Describe the Enhancing NeuroImaging Genetics through Meta-Analysis (ENIGMA) Consortium

The Enhancing NeuroImaging genetics through Meta-Analysis (ENIGMA) Consortium is a collaborative network of researchers working together on a range of large-scale studies that integrate data from 70 institutions worldwide. Organized into Working groups that tackle questions in neuroscience, genetics, and medicine, ENIGMA studies have analyzed neuroimaging data from over 12,826 subjects. In addition, data from 12,189 individuals have been provided by the Charcot-Marie-Tooth [CMT] Consortium for replication of findings, in a total of 24,997 subjects.